Use of any prescription drug or over-the-counter (OTC) medication which is prohibited by the protocol.

The above is a clinical trial exclusion criterion. Annotated with entity spans:
Use of any [Drug: prescription drug] or [Drug: over-the-counter (OTC) medication] which is [Qualifier: prohibited by the protocol].